某一急診病患主訴突發左腳無力，經電腦斷層檢查後顯示腦梗塞，最有可能是因為那一條血管阻塞？
A. 中腦動脈
B. 前腦動脈
C. 後腦動脈
D. 基底動脈

正確答案：B. 前腦動脈